Clinical trial inclusion criterion:
Right handed

Annotated entities:
- Condition: "Right handed"